Clinical trial exclusion criterion:
Subjects for whom a single dose of 1.0 milligram (mg) dexamethasone acetate may be contraindicated

Entity relations:
- AND("contraindicated", "dexamethasone acetate")
- Has_multiplier("dexamethasone acetate", "dose of 1.0 milligram (mg)")
- Has_multiplier("dexamethasone acetate", "single")